Clinical trial inclusion criterion:
Signed informed consent form

Annotated entities:
- Informed_consent: "Signed informed consent form"